Undiagnosed vaginal bleeding.

The above is a clinical trial exclusion criterion. Annotated with entity spans:
[Qualifier: Undiagnosed] [Condition: vaginal bleeding].